Clinical trial exclusion criterion:
Active smoking during the last 12 months from screening date.

Entity relations:
- Has_temporal("Active smoking", "Active")
- Has_index("during the last 12 months from screening date", "screening date")
- Has_temporal("Active smoking", "during the last 12 months from screening date")